Un niño de 13 años presenta dolor dorsal de varios meses de evolución, sólo a la bipedestación y a la marcha. ¿Qué diagnóstico debemos de pensar?
1. Enfermedad de Scheuermann.
2. Escoliosis torácica.
3. Tumor maligno del cuerpo vertebral.
4. Se trata de una sobrecarga mecánica.

Respuesta correcta: 1. Enfermedad de Scheuermann.